Clinical trial exclusion criterion:
CNS or other severe organ manifestation of lupus that necessitate aggressive immunosuppressive therapy on its own.

Annotated entities:
- Qualifier: "CNS"
- Condition: "lupus"
- Qualifier: "organ manifestation"
- Procedure: "immunosuppressive therapy"